Any MS relapse in the last five years, as determined at the screen visit by the PI

The above is a clinical trial exclusion criterion. Annotated with entity spans:
Any [Condition: MS] [Condition: relapse] [Temporal: in the last five years], as determined at the screen visit by the PI